Clinical trial exclusion criterion:
Baseline LIC >30 mg/g dw (measured by MRI);

Entity relations:
- Has_value("LIC", ">30 mg/g")
- Has_temporal("LIC", "Baseline")
- Has_mood("MRI", "measured by")
- AND("LIC", "MRI")